2. Patients with at least 1 ≥50% stenosis in a coronary vessel, subjected to FFR assessment, who exhibit variation in Pd / Pa ratio ≥ 0.05 (e.g. difference of max Pd/Pa minus min Pd/Pa) during steady state hyperaemia (determined by visual assessment).

The above is a clinical trial inclusion criterion. Annotated with entity spans:
[Parsing_Error: 2.] Patients with [Multiplier: at least 1] [Value: ≥50%] [Measurement: stenosis in a coronary vessel], subjected to [Procedure: FFR assessment], who exhibit [Condition: variation in Pd / Pa ratio] [Value: ≥ 0.05] (e.g. difference of [Measurement: max Pd/Pa] minus [Measurement: min Pd/Pa]) during [Qualifier: steady state] [Condition: hyperaemia] (determined by [Procedure: visual assessment]).